病患來門診求診時，發現右手第四、五指無法完全伸直，張開手檢查時，小魚肌（hypothenar muscle）有萎縮現象，被診斷為鷹爪手（claw hand），是下列那一條神經受損？
A. 尺神經（ulnar nerve）
B. 橈神經（radial nerve）
C. 正中神經（median nerve）
D. 肌皮神經（musculocutaneous nerve）

正確答案：A. 尺神經（ulnar nerve）